Clinical trial inclusion criterion:
Prior radiation therapy, chemotherapy, or surgery in patients requiring flap reconstruction in the head and neck region.

Entity relations:
- AND("requiring flap reconstruction", "flap reconstruction")
- Has_qualifier("flap reconstruction", "head and neck region")
- OR("radiation therapy", "chemotherapy", "surgery")